一位病患疑似有維生素B12缺乏現象，下列何種血液變化最不支持此一診斷？
A. 甲基丙二酸（methylmalonic acid）過高
B. 對羥基苯丙酮酸（para-hydroxyphenylpyruvate）過高
C. 紅血球過少
D. 巨母紅血球過多

正確答案：B. 對羥基苯丙酮酸（para-hydroxyphenylpyruvate）過高